Clinical trial exclusion criterion:
Trial of < 2 AEDs

Annotated entities:
- Drug: "AEDs"
- Multiplier: "< 2"